下列何者的異常值高低和粒線體疾病的病況嚴重程度最相關？
A. 血中乳酸量的高低
B. 血中乳酸去氫酶（lactic dehydrogenase, LDH）的活性
C. 脊髓液中的蛋白質含量
D. 脊髓液中免疫球蛋白G的指數（IgG index）

正確答案：A. 血中乳酸量的高低